Clinical trial inclusion criterion:
At the cluster level, ED physicians practicing at a participating site will be eligible.

Annotated entities:
- Non-query-able: "At the cluster level, ED physicians practicing at a participating site will be eligible."
- Context_Error: "At the cluster level"
- Parsing_Error: "At the cluster level"